Clinical trial exclusion criterion:
Anticipated survival of less than 3 months.

Annotated entities:
- Observation: "Anticipated survival"
- Value: "less than 3 months"